Clinical trial exclusion criterion:
Presence of any infertility factor other than anovulation/oligoovulation.

Annotated entities:
- Condition: "infertility factor"
- Negation: "other than"
- Condition: "anovulation"
- Condition: "oligoovulation"